Subject has documented typical atrial flutter.

The above is a clinical trial exclusion criterion. Annotated with entity spans:
Subject has documented typical [Condition: atrial flutter].